Clinical trial inclusion criterion:
Patient who had been diagnosed within the previous 12 months with HbA1c levels of 8.0-12.0%, did not have a medical history related to diabetes, and did not display proliferative retinopathy

Annotated entities:
- Measurement: "HbA1c"
- Value: "8.0-12.0%"
- Temporal: "previous 12 months"
- Negation: "not"
- Condition: "proliferative retinopathy"
- Negation: "not"
- Temporal: "medical history related to diabetes"